Has a diagnosis of immunodeficiency or is receiving systemic steroid therapy or any other form of immunosuppressive therapy within 7 days prior to the first dose of study medication

The above is a clinical trial exclusion criterion. Annotated with entity spans:
Has a diagnosis of [Condition: immunodeficiency] or is receiving [Procedure: systemic steroid therapy] or any other form of [Procedure: immunosuppressive therapy] [Temporal: within 7 days prior] to [Reference_point: the first dose of study medication]